Clinical trial inclusion criterion:
No change to AD medications within the month preceding randomization, including starting, stopping, or dosage modifications

Annotated entities:
- Drug: "AD medications"
- Temporal: "within the month preceding randomization"
- Reference_point: "randomization"
- Observation: "change to AD medications"
- Negation: "No"